En cuanto a la estabilidad de los fármacos de naturaleza proteica de los medicamentos biotecnológicos podemos decir:
1. Que es fuertemente dependiente del pH.
2. Que se ve poco afectada por la fuerza iónica.
3. Que al ser en general tan elevada no suele dar problemas en la formulación.
4. Que su valor máximo tiene lugar al valor del pH de menor solubilidad.
5. Que tiene una ligera dependencia con de la temperatura.

Respuesta correcta: 1. Que es fuertemente dependiente del pH.